Clinical trial exclusion criterion:
Any unstable systematic disease (including active infection, uncontrolled high blood pressure, unstable angina, onset of angina within the last 3 months, congestive heart failure, myocardial infarction within the previous 12 months, severe arrhythmia needing drug treatment, liver, kidney or metabolic disease)

Annotated entities:
- Condition: "systematic disease"
- Qualifier: "unstable"
- Condition: "infection"
- Condition: "high blood pressure"
- Qualifier: "uncontrolled"
- Condition: "unstable angina"
- Temporal: "within the last 3 months"
- Measurement: "onset"
- Condition: "angina"
- Condition: "congestive heart failure"
- Condition: "myocardial infarction"
- Temporal: "within the previous 12 months"
- Qualifier: "severe"
- Condition: "arrhythmia"
- Drug: "drug"
- Procedure: "treatment"
- Condition: "metabolic disease"
- Condition: "kidney disease"
- Condition: "liver disease"